下列何者為麴菌（Aspergillus spp.）之型態特徵？
A. 具假根（rhizoid）
B. 具厚壁孢子（chlamydospores）
C. 菌絲（hyphae）無分隔
D. 具瓶狀（flask-shaped）孢子梗（phialides）

正確答案：D. 具瓶狀（flask-shaped）孢子梗（phialides）